Clinical trial exclusion criterion:
History of substance dependence diagnosis by MINI-KID (excluding tobacco) or positive urine toxicology.

Annotated entities:
- Temporal: "History"
- Condition: "substance dependence"
- Procedure: "MINI-KID"
- Drug: "tobacco"
- Negation: "excluding"
- Value: "positive"
- Measurement: "urine toxicology"